Greater than 34 weeks gestation

The above is a clinical trial inclusion criterion. Annotated with entity spans:
[Value: Greater than 34 weeks] [Condition: gestation]